Clinical trial inclusion criterion:
Singleton pregnancy = 37 weeks gestation

Entity relations:
- Has_value("gestation", "= 37 weeks")